In the Investigator's opinion, is able and willing to comply with all trial requirements.

The above is a clinical trial inclusion criterion. Annotated with entity spans:
[Post-eligibility: In the Investigator's opinion, is able and willing to comply with all trial requirements].